Adequate bone marrow function(absolute neutrophil count [ANC] ≥1,500/µL, hemoglobin ≥9.0 g/dL,and platelets ≥100,000/µL)

The above is a clinical trial inclusion criterion. Annotated with entity spans:
[Value: Adequate] [Measurement: bone marrow function]([Measurement: absolute neutrophil count [ANC]] [Value: ≥1,500/µL], [Measurement: hemoglobin] [Value: ≥9.0 g/dL],and [Measurement: platelets] [Value: ≥100,000/µL])